Clinical trial exclusion criterion:
Contra-indications to muscle relaxants: 1) Concurrent use of centrally acting opioids; 2) Renal impairment; 3) Liver abnormality including cirrhosis or elevated enzymes 4) Use of any of the following medications: fluvoxamine, fluoroquinolones, amiodarone, mexiletine, propafenone, verapamil, cimetidine, famotidine, acyclovir, ticlopidine, oral contraceptive pills

Annotated entities:
- Condition: "Contra-indications"
- Drug: "muscle relaxants"
- Temporal: "Concurrent"
- Drug: "centrally acting opioids"
- Condition: "Renal impairment"
- Condition: "Liver abnormality"
- Condition: "cirrhosis"
- Condition: "elevated enzymes"
- Drug: "fluvoxamine"
- Drug: "fluoroquinolones"
- Drug: "amiodarone"
- Drug: "mexiletine"
- Drug: "propafenone"
- Drug: "verapamil"
- Drug: "cimetidine"
- Drug: "famotidine"
- Drug: "acyclovir"
- Drug: "ticlopidine"
- Drug: "oral contraceptive pills"